F; age 18 to 70

The above is a clinical trial inclusion criterion. Annotated with entity spans:
[Person: F]; [Person: age] [Value: 18 to 70]